Planned to use patient-controlled intravenous analgesia after surgery;

The above is a clinical trial inclusion criterion. Annotated with entity spans:
Planned to use [Qualifier: patient-controlled] [Procedure: intravenous analgesia] [Temporal: after surgery];